Los iones enolato experimentan adición conjugada a aldehídos y cetonas α,β-insaturados, reacción que se conoce como:
1. Adición de Michael.
2. Adición de Prins.
3. Transposición de Cope.
4. Adición radicalaria.
5. Transposición de Beckman.

Respuesta correcta: 1. Adición de Michael.